Clinical trial inclusion criteria:
Adult subjects aged 18 years or older
Scheduled for elective posterior lumbar spinal fusion surgery between 1 and 3 levels

Annotated entities:
- Person: "Adult"
- Person: "aged"
- Value: "18 years or older"
- Procedure: "posterior lumbar spinal fusion surgery"
- Qualifier: "elective"
- Mood: "Scheduled for"
- Qualifier: "between 1 and 3 levels"